Severe impairment of liver or pancreatic function.

The above is a clinical trial exclusion criterion. Annotated with entity spans:
[Qualifier: Severe] [Condition: impairment of liver] or pancreatic function.